Clinical trial inclusion criterion:
Brain death

Annotated entities:
- Condition: "Brain death"